Which company developed ivosidenib?

Ivosidenib has been developed by Agios Pharmaceuticals.